Chronic (longer than 14 days) administration of immunosuppressants or other immune-modifying drugs within 6 months before the first dose of investigational vaccine; oral corticosteroids in dosages of =0.5 mg/kg/d prednisolone or equivalent are excluded; inhaled or topical steroids are allowed

The above is a clinical trial exclusion criterion. Annotated with entity spans:
[Multiplier: Chronic] ([Multiplier: longer than 14 days]) administration of [Drug: immunosuppressants] or [Qualifier: other] [Drug: immune-modifying drugs] [Temporal: within 6 months before the first dose of investigational vaccine]; [Drug: oral corticosteroids] in [Multiplier: dosages] of [Value: =0.5 mg/kg/d] [Qualifier: prednisolone or equivalent] are [Negation: excluded]; [Non-representable: inhaled or topical steroids are allowed]